Have a total baseline score on the Brief Psychiatric Rating Scale (BPRS) = 45;

The above is a clinical trial inclusion criterion. Annotated with entity spans:
Have a total baseline score on the [Measurement: Brief Psychiatric Rating Scale] ([Measurement: BPRS]) [Value: = 45];